Clinical trial exclusion criterion:
Leg ulcerations or infections in the foot.

Entity relations:
- OR("Leg ulcerations", "infections in the foot")